Clinical trial exclusion criterion:
Intracranial lesion associated with increased intracranial pressure

Entity relations:
- Has_value("intracranial pressure", "increased")
- AND("Intracranial lesion", "intracranial pressure")